Clinical trial inclusion criterion:
Licensed nursing home in Orange County or Southern Los Angeles County serving adults

Entity relations:
- Has_qualifier("Licensed nursing home", "serving adults")
- OR("Licensed nursing home", "Southern Los Angeles County", "Orange County")